Las condiciones de reacción para la preparación de 2-metil-2-metoxipropan-1-ol a partir de 2,2-dimetiloxirano son:
1. Metanol en medio ácido.
2. Hidruro de litio y aluminio en metanol.
3. Bromuro de metilmagnesio e hidrólisis posterior.
4. Metóxido de sodio en metanol.
5. Trifenilfosfina en metanol.

Respuesta correcta: 1. Metanol en medio ácido.